De los siguientes enunciados, uno NO es un desencadenante       de       las     crisis abdominopsiconeurológicas en la porfiria aguda. Indique cuál:
1. La fase lútea del ciclo menstrual.
2. Los fármacos inductores enzimáticos hepáticos.
3. Las infecciones.
4. Una dieta restrictiva en proteínas.
5. Los inhibidores de la proteasa empleados en la infección por el VIH.

Respuesta correcta: 4. Una dieta restrictiva en proteínas.